Clinical trial exclusion criterion:
history of asthma, acute rhinitis, nasal polyps, angioedema, urticaria or allergic reactions to aspirin or other non-steroidal anti-inflammatory drugs(including COX-2 inhibitors).

Annotated entities:
- Condition: "asthma"
- Condition: "acute rhinitis"
- Condition: "nasal polyps"
- Condition: "angioedema"
- Condition: "urticaria"
- Condition: "allergic reactions"
- Drug: "aspirin"
- Qualifier: "other"
- Drug: "non-steroidal anti-inflammatory drugs"
- Drug: "COX-2 inhibitors"